Mujer de 40 años que consulta por aproximadamente 20 episodios al día de dolor intenso, periocular izquierdo de 15 minutos de duración, acompañado de intenso lagrimeo y rinorrea. Su exploración y resonancia magnética son normales. Su tratamiento de elección sería:
1. Indometacina.
2. Lamotrigina.
3. Verapamilo.
4. Prednisona.
5. Carbonato de litio.

Respuesta correcta: 1. Indometacina.